Patients surgically treated for the same defect within one year;

The above is a clinical trial exclusion criterion. Annotated with entity spans:
Patients [Procedure: surgically treated] for [Condition: the same defect] [Temporal: within one year];